Clinical trial inclusion criterion:
Scheduled to undergo surgery for primary solid organ cancer under general anesthesia, with an expected duration of surgery >=2 hours;

Annotated entities:
- Mood: "Scheduled"
- Procedure: "surgery"
- Qualifier: "primary"
- Condition: "solid organ cancer"
- Procedure: "general anesthesia"
- Non-representable: "with an expected duration of surgery >=2 hours;"